副甲狀腺腺瘤併副甲狀腺機能亢進的手術，術前定位以何種為最有效的選擇？
A. 超音波（ultrasound）
B. MIBI掃描（sestamibi scan）
C. 正子掃描（PET）
D. 核磁共振（MRI）

正確答案：B. MIBI掃描（sestamibi scan）